下列有關平滑肌之敘述，何者錯誤？
A. 具有終生分裂之能力
B. thin actin-containing filament參與收縮功能
C. 藉由sliding filament mechanism參與收縮功能
D. dense body存在於細胞核中

正確答案：D. dense body存在於細胞核中